下列何種 immunoglobulin（Ig）可促使 basophils 和 mast cells 分泌組織胺（histamine）？
A. Ig M
B. Ig A
C. Ig E
D. Ig G

正確答案：C. Ig E